Persons with a history of Guillain-Barré Syndrome

The above is a clinical trial exclusion criterion. Annotated with entity spans:
Persons with a history of [Condition: Guillain-Barré Syndrome]